Clinical trial exclusion criterion:
Tumors.

Annotated entities:
- Condition: "Tumors"